下列何者不負責乳腺之血液供應？
A. 肋間動脈（intercostal artery）
B. 內胸動脈（internal thoracic artery）
C. 外胸動脈（lateral thoracic artery）
D. 肋下動脈（subcostal artery）

正確答案：D. 肋下動脈（subcostal artery）